¿Cuál es el objetivo terapéutico de la Sensibilización Encubierta?:
1. Desarrollar una respuesta de atracción hacia un estímulo que anteriormente era una fuente de aversión.
2. Aumentar la tolerancia a un estímulo aversivo y reducir la activación emocional que produce.
3. Posponer los refuerzos positivos inmediatos de conductas no deseables.
4. Desarrollar una respuesta de aversión hacía un estímulo que anteriormente era una fuente de atracción.
5. Reforzar mentalmente los ensayos exitosos dirigidos a la consecución de la conducta objetivo.

Respuesta correcta: 4. Desarrollar una respuesta de aversión hacía un estímulo que anteriormente era una fuente de atracción.